Diagnosed or told by a clinician that they have any of the following bipolar spectrum disorders (BSD): bipolar I, bipolar II, unspecified bipolar and related disorders, Disruptive Mood Dysregulation Disorder (DMDD), cyclothymic disorder, other specified bipolar and related disorders, as well as mood disorder not otherwise specified (if diagnosed in the past as per DSM-IV);

The above is a clinical trial inclusion criterion. Annotated with entity spans:
Diagnosed or told by a clinician that they have any of the following [Condition: bipolar spectrum disorders] ([Condition: BSD]): [Condition: bipolar I], [Condition: bipolar II], [Condition: unspecified bipolar and related disorders], [Condition: Disruptive Mood Dysregulation Disorder] ([Condition: DMDD]), [Condition: cyclothymic disorder], [Condition: other specified bipolar and related disorders], as well as [Condition: mood disorder not otherwise specified] (if diagnosed in the past as per DSM-IV);